Clinical trial exclusion criterion:
Chronic usage of steroids or other immunosuppressant medication.

Entity relations:
- Has_multiplier("steroids", "Chronic usage")
- Has_multiplier("immunosuppressant medication", "Chronic usage")
- OR("steroids", "immunosuppressant medication")